認知學說解釋情緒障礙，認為最主要的影響因素是？
A. 想法
B. 事件本身
C. 結果
D. 潛意識

正確答案：A. 想法